¿Cuál de las siguientes afirmaciones NO es cierta acerca del glucagón?:
1. Activa la glucogenogénesis hepática.
2. Activa la lipólisis en el tejido adiposo blanco.
3. Activa la glucogenolisis hepática.
4. Es un polipéptido.
5. Se sintetiza en las células α de los islotes de Langerhans del páncreas.

Respuesta correcta: 1. Activa la glucogenogénesis hepática.